Clinical trial exclusion criterion:
Current non-steroidal anti-inflammatory drug (NSAID) use

Annotated entities:
- Drug: "non-steroidal anti-inflammatory drug"
- Drug: "NSAID"